Clinical trial exclusion criterion:
A history of bleeding tendency;

Entity relations:
- Has_temporal("bleeding tendency", "history")